Treatment with any investigational drug within 30 days of entry to this protocol

The above is a clinical trial exclusion criterion. Annotated with entity spans:
[Competing_trial: Treatment with any investigational drug within 30 days of entry to this protocol]